Clinical trial exclusion criterion:
internal, neurologic or psychiatric disease that interfere with protocol compliance including current heavy smoking (>20 cigarettes per day), inability to perform 6 min walk test.

Entity relations:
- Has_qualifier("smoking", "heavy")
- Has_multiplier("smoking", ">20 cigarettes per day")
- Has_negation("6 min walk test", "inability")
- OR("internal disease", "neurologic disease", "psychiatric disease")